Yale-Brown Obsessive-Compulsive Scale (Y-BOCS) score of = 16

The above is a clinical trial inclusion criterion. Annotated with entity spans:
[Measurement: Yale-Brown Obsessive-Compulsive Scale] ([Measurement: Y-BOCS]) [Value: score of = 16]